Clinical trial exclusion criterion:
History of tuberculosis , presence of active tuberculosis, or latent tuberculosis

Annotated entities:
- Procedure: "tuberculosis"
- Procedure: "tuberculosis"
- Procedure: "tuberculosis"
- Qualifier: "latent"
- Qualifier: "active"
- Temporal: "History"